Clinical trial exclusion criterion:
Severe coagulation disorder: prothrombin time <40% (or INR >1.7) or platelet count <30,000/mm3

Entity relations:
- Has_value("INR", ">1.7")
- Has_value("platelet count", "<30,000/mm3")
- Subsumes("prothrombin time", "INR")
- Has_qualifier("coagulation disorder", "Severe")
- AND("coagulation disorder", "prothrombin time")
- Has_value("prothrombin time", "<40%")
- OR("prothrombin time", "platelet count", "INR")